下列有關精索靜脈曲張（varicocele）的敘述，何者錯誤？
A. 精索靜脈曲張是造成男性不孕常見原因
B. 90%發生在右側
C. 後腹腔腫瘤可造成精索靜脈曲張
D. 精索靜脈曲張會引起精蟲活動力減少

正確答案：B. 90%發生在右側